Clinical trial exclusion criterion:
Unable to sign an informed consent

Annotated entities:
- Post-eligibility: "Unable to sign an informed consent"